Clinical trial exclusion criterion:
Previous treatment with systemic corticosteroids or a change in dosage of thyroid hormones in the previous 6 weeks

Annotated entities:
- Drug: "systemic corticosteroids"
- Drug: "thyroid hormones"
- Qualifier: "change in dosage"
- Temporal: "previous 6 weeks"